下列那一個酵素的缺陷，最可能導致嘌呤核苷降解（purine nucleoside degradation）的異常，導致免疫缺陷疾病（immunodeficiency diseases）的發生？
A. Adenosine deaminase
B. AMP aminohydrolase
C. Purine oxidase
D. Xanthine oxidoreductase

正確答案：A. Adenosine deaminase